Clinical trial inclusion criterion:
15 weeks 0 days gestational age - 23 weeks 5 days gestational age at time of dilator insertion

Annotated entities:
- Value: "15 weeks 0 days - 23 weeks 5 days"
- Measurement: "gestational age"
- Temporal: "at time of dilator insertion"
- Reference_point: "dilator insertion"